理學檢查發現病人耳膜有一三角形破孔，最可能致病原因為：
A. 急性化膿性中耳炎
B. 慢性化膿性中耳炎
C. 慢性積液性中耳炎
D. 外傷

正確答案：D. 外傷